Clinical trial inclusion criterion:
Age 18 to 65 years

Annotated entities:
- Person: "Age"
- Value: "18 to 65 years"